American Heart Association class >3

The above is a clinical trial exclusion criterion. Annotated with entity spans:
[Measurement: American Heart Association class] [Value: >3]